Clinical trial exclusion criterion:
Diabetes or high blood sugar diagnosed by a doctor

Annotated entities:
- Condition: "Diabetes"
- Condition: "high blood sugar"